Clinical trial exclusion criterion:
Patients who had taken PPI, H2 receptor antagonists and antibiotics within 4 weeks

Annotated entities:
- Drug: "PPI"
- Drug: "H2 receptor antagonists"
- Drug: "antibiotics"
- Temporal: "within 4 weeks"
- Grammar_Error: "and"